Clinical trial inclusion criterion:
Aged at least 18 years with an ability and willingness to give written informed consent.

Annotated entities:
- Person: "Aged"
- Value: "at least 18 years"
- Observation: "ability to give written informed consent"
- Observation: "willingness to give written informed consent"